Women of child bearing potential, unless they are using an effective method of birth control

The above is a clinical trial exclusion criterion. Annotated with entity spans:
[Pregnancy_considerations: Women of child bearing potential, unless they are using an effective method of birth control]